Clinical trial exclusion criterion:
Known allergic reaction to a histone deacetylase inhibitor

Entity relations:
- causal("allergic reaction", "histone deacetylase inhibitor")